Mujer de 50 años de edad que desde hace 1 mes presenta un ánimo deprimido, anhedonia, pérdida de memoria, llanto fácil, pérdida de energía, sensación de inutilidad y culpa, pérdida de peso marcada y despertar precoz, así como incapacidad para realizar sus tareas habituales en el hogar. En trámites de separación desde hace 3 meses. Señale el diagnóstico más apropiado:
1. Distimia.
2. Seudodemencia.
3. Trastorno adaptativo depresivo.
4. Episodio de depresión mayor.
5. Depresión menor.

Respuesta correcta: 4. Episodio de depresión mayor.